Es una enfermedad asociada con defectos en la reparación del ADN:
1. Enfermedad de Tay-Sachs.
2. Acatalasemia.
3. Síndrome de Marfan.
4. Cáncer colorrectal hereditario no polipósico.

Respuesta correcta: 4. Cáncer colorrectal hereditario no polipósico.